Clinical trial exclusion criterion:
Subjects who have received RBC transfusions cannot have >15% adult hemoglobin

Annotated entities:
- Procedure: "RBC transfusions"
- Negation: "cannot have"
- Value: ">15% adult hemoglobin"